以下關於胸腔鏡手術之描述，何者正確？
A. 胸腔鏡手術時必須在肋膜腔灌入二氧化碳，使肺臟塌陷以利手術之進行
B. 胸腔鏡手術適用於良性疾病之診斷及治療，惡性疾病最好利用開胸手術以免腫瘤擴散
C. 胸腔鏡的手術畫面為鏡像（左右相反），因此必須長期練習才能熟悉手術器械之操作
D. 胸腔鏡手術時，需用雙管氣管插管（Double-lumen endotracheal tube），使單側肺部塌陷，以利手術之進行

正確答案：D. 胸腔鏡手術時，需用雙管氣管插管（Double-lumen endotracheal tube），使單側肺部塌陷，以利手術之進行